Who received the Nobel prize for development of CRISPR?

CRISPR has finally won a Nobel Prize. Jennifer Doudna and Emmanuelle Charpentier have been awarded the ultimate science prize for their breakthrough research on CRISPR technology.